What is the percentage of individuals at risk of dominant medically actionable disease?

1 in 38 individuals at risk of a dominant medically actionable disease.